當一完整的粒線體的電子傳遞鏈被氰化物（cyanide）阻斷時，下列何種情況為真？
A. 由 NADH 所傳遞的電子會被阻斷，但氧氣的消耗可以繼續
B. 由琥珀酸（succinate）所傳遞的電子會被阻斷，但氧氣的消耗可以繼續
C. ATP 的合成會繼續，但 P/O 值會下降
D. 所有 ATP 的合成會停止

正確答案：D. 所有 ATP 的合成會停止